Clinical trial inclusion criterion:
Qualifies for prostaglandin administration according to current Parkland protocol

Annotated entities:
- Procedure: "prostaglandin administration"
- Procedure: "Parkland protocol"